Able to provide verbal consent

The above is a clinical trial inclusion criterion. Annotated with entity spans:
[Informed_consent: Able to provide verbal consent]